Clinical trial exclusion criterion:
History of allergic reaction to abciximab or eptifibatide or any component used in the study (including contrast media)

Annotated entities:
- Condition: "allergic reaction"
- Temporal: "History"
- Drug: "abciximab"
- Drug: "eptifibatide"
- Drug: "component used in the study"
- Drug: "contrast media"